脂肪酸 cis-, cis-delta 9, delta 12-octadecadienoate 是指下列何者？
A. oleate
B. palmitoleate
C. linoleate
D. arachidonate

正確答案：C. linoleate